李先生現年 53 歲，患糖尿病 4 年；兩週前，他的弟弟（現年 49 歲），用哥哥的血糖機測空腹血糖為 112 mg/dL，恐有糖尿病，於是前來門診希望確定是否有糖尿病。下列那一項資料對判定他是否確定有糖尿病最有幫助？
A. 尿液分析
B. 糖化血色素
C. 空腹血漿糖
D. 口服耐糖試驗

正確答案：D. 口服耐糖試驗